有關急性骨髓性白血病（AML）的描述，下列何者最正確？
A. 整體而言，AML五年存活率比急性淋巴性白血病（ALL）佳
B. 為Down syndrome 1～3歲時，最常見之白血病
C. 發生率是急性淋巴性白血病（ALL）的3倍
D. 使用干擾素、Hydroxyurea及Ara-c的組合，治癒率與移植相同

正確答案：B. 為Down syndrome 1～3歲時，最常見之白血病